contraindication for collagenase clostridium histolyticym (Xiapex/Xiaflex ®)

The above is a clinical trial exclusion criterion. Annotated with entity spans:
[Condition: contraindication] for [Drug: collagenase clostridium histolyticym] ([Drug: Xiapex]/[Drug: Xiaflex] ®)